Clinical trial exclusion criterion:
9. Chronic infection related to tuberculosis or fungal or mycobacterial disease.

Entity relations:
- Has_multiplier("infection", "Chronic")
- Has_context("tuberculosis", "related to")
- AND("infection", "tuberculosis")
- OR("tuberculosis", "fungal disease", "mycobacterial disease")